Normal uterine cavity on ultrasound exam (e.g., no presence of hydrosalpinx)

The above is a clinical trial inclusion criterion. Annotated with entity spans:
[Observation: Normal uterine cavity] on [Procedure: ultrasound exam] (e.g., [Negation: no presence of] [Condition: hydrosalpinx])